renal insufficiency III-V °

The above is a clinical trial exclusion criterion. Annotated with entity spans:
[Condition: renal insufficiency] [Qualifier: III-V °]